瀰漫性間質性肺病變（diffuse interstitial lung disease）病人的理學檢查，最不可能出現下列何者？
A. 呼吸促迫（tachypnea）
B. 兩側肺下野吸氣囉音（crackle）
C. 杵狀指（clubbing fingers）
D. 兩側對稱性關節腫大（hypertrophic osteoarthropathy）

正確答案：D. 兩側對稱性關節腫大（hypertrophic osteoarthropathy）